Clinical trial exclusion criterion:
Prominent personality disorder

Annotated entities:
- Condition: "Prominent personality disorder"